Clinical trial inclusion criterion:
2. Patients who have received prior adjuvant therapy for early-stage lung cancer are eligible if at least 12 months have elapsed from that treatment.

Annotated entities:
- Procedure: "adjuvant therapy"
- Condition: "early-stage lung cancer"
- Temporal: "at least 12 months have elapsed from that treatment"
- Reference_point: "that treatment"
- Procedure: "treatment"